Clinical trial inclusion criterion:
PDR patients requiring surgical intervention for complications of vitreous hemorrhage or traction retinal detachment and pre-operative IVC treatment.

Annotated entities:
- Condition: "PDR"
- Procedure: "surgical intervention"
- Mood: "requiring"
- Condition: "vitreous hemorrhage"
- Condition: "traction retinal detachment"
- Qualifier: "pre-operative"
- Procedure: "IVC treatment"